Clinical trial inclusion criteria:
Newly diagnosed and untreated sputum smear positive tuberculosis patient
Pulmonary lesion consistent with TB by radiological examination
Positive sputum culture, identification of bacterial type confirmed Mycobacterium tuberculosis. MGIT drug sensitivity test (DST) results are sensitive of the first-line drugs (isoniazid, streptomycin, rifampicin and ethambutol).
Age 18 years-65 years old
Males or non-pregnant, non-nursing females
Serum or plasma aminotransferases (AST, ALT) less than 3 times the upper limit of normal
Serum or plasma total bilirubin less than or equal to 2.5 times the upper limit of normal
Serum or plasma creatinine level less than or equal to 2 times the upper limit of normal
Serum or plasma potassium level greater than or equal to 3.5 meq/L
Hemoglobin level of 7.0 g/dL or greater
Platelet count of 100,000/mm3 or greater
For women of childbearing potential, a negative pregnancy test is required during screening
Provides written informed consent
Willingness and ability to attend scheduled follow-up visits and undergo study assessments.

Annotated entities:
- Qualifier: "untreated"
- Qualifier: "Newly diagnosed"
- Measurement: "sputum smear"
- Value: "positive"
- Condition: "tuberculosis"
- Condition: "Pulmonary lesion"
- Condition: "TB"
- Procedure: "radiological examination"
- Qualifier: "consistent with TB"
- Value: "Positive"
- Measurement: "sputum culture"
- Condition: "Mycobacterium tuberculosis"
- Qualifier: "bacterial type"
- Measurement: "MGIT drug sensitivity test (DST)"
- Value: "sensitive of the first-line drugs (isoniazid, streptomycin, rifampicin and ethambutol)"
- Drug: "first-line drugs"
- Drug: "isoniazid"
- Drug: "streptomycin"
- Drug: "rifampicin"
- Drug: "ethambutol"
- Person: "Age"
- Value: "18 years-65 years old"
- Person: "Males"
- Negation: "non-"
- Condition: "pregnant"
- Negation: "non-"
- Observation: "nursing"
- Person: "females"
- Measurement: "plasma aminotransferases"
- Measurement: "AST"
- Measurement: "ALT"
- Measurement: "Serum aminotransferases"
- Value: "less than 3 times the upper limit of normal"
- Qualifier: "plasma"
- Qualifier: "Serum"
- Measurement: "total bilirubin"
- Value: "less than or equal to 2.5 times the upper limit of normal"
- Qualifier: "plasma"
- Qualifier: "Serum"
- Measurement: "creatinine level"
- Value: "less than or equal to 2 times the upper limit of normal"
- Qualifier: "Serum"
- Qualifier: "plasma"
- Measurement: "potassium level"
- Value: "greater than or equal to 3.5 meq/L"
- Measurement: "Hemoglobin level"
- Value: "7.0 g/dL or greater"
- Measurement: "Platelet count"
- Value: "100,000/mm3 or greater"
- Person: "women"
- Observation: "childbearing potential"
- Value: "negative"
- Measurement: "pregnancy test"
- Temporal: "during screening"
- Reference_point: "screening"
- Observation: "written informed consent"
- Mood: "ability to attend scheduled follow-up visits"
- Observation: "ability to undergo study assessments"
- Mood: "to attend scheduled follow-up visits Willingness"
- Observation: "to undergo study assessments Willingness"